Clinical trial exclusion criterion:
Chronic pain or narcotic usage during the preceding 30 days

Entity relations:
- Has_temporal("Chronic pain", "during the preceding 30 days")
- OR("Chronic pain", "narcotic")